The "as-needed" (prn) use of psychoactive and other drugs such as antibiotics is not excluded; however, such use must be discussed with a clinician prescriber and documented.

The above is a clinical trial exclusion criterion. Annotated with entity spans:
[Non-representable: The "as-needed" (prn) use of psychoactive and other drugs such as antibiotics is not excluded; however, such use must be discussed with a clinician prescriber and documented.]